Clinical trial inclusion criterion:
Patients with major depressive disorder according to DSM-IV criteria that have lasted >8 weeks

Annotated entities:
- Condition: "major depressive disorder"
- Measurement: "DSM-IV criteria"
- Temporal: "lasted >8 weeks"